For how long do Drosophila embryos use maternal genome mRNA?

In Drosophila embryogenesis mitoses before interphase 14 run on maternal products, and occur in metasynchronous waves.